Clinical trial exclusion criterion:
Documented positive hepatitis B (HBV) surface antigen, and/or HBV DNA prior to enrollment

Entity relations:
- Has_index("prior to enrollment", "enrollment")
- Has_value("hepatitis B surface antigen", "positive")
- Has_temporal("hepatitis B surface antigen", "prior to enrollment")
- OR("hepatitis B surface antigen", "HBV DNA")